19. Subject with previous history of tumor, or current tumor patient, or subject with pre-cancerous disease manifested by pathological examination (such as ductal carcinoma in situ or cervical epithelial dysplasia)

The above is a clinical trial exclusion criterion. Annotated with entity spans:
19. Subject with [Temporal: previous history] of [Condition: tumor], or [Temporal: current] [Condition: tumor] patient, or subject with [Condition: pre-cancerous disease] manifested by [Procedure: pathological examination] (such as [Condition: ductal carcinoma in situ] or [Condition: cervical epithelial dysplasia])